Clinical trial exclusion criterion:
Known history of prior intracranial bleeding

Entity relations:
- Has_qualifier("intracranial bleeding", "prior")